下列有關人類染色體的敘述，何者錯誤？
A. 有 22 對體染色體
B. 有兩個性染色體，X 和 Y
C. 46,XX 和 47,XXY 都是女性
D. X 和 Y 染色體有一小部分的相似度很高，被稱為 pseudo-autosomal region

正確答案：C. 46,XX 和 47,XXY 都是女性